當懷疑有抗磷脂質抗體症候群（antiphospholipid antibody syndrome）時，下列的何種檢查最為重要？
A. C3 及 C4
B. prothrombin time 及 activated partial thromboplastin time
C. ESR 及 CRP
D. cholesterol 及 triglyceride

正確答案：B. prothrombin time 及 activated partial thromboplastin time